Unable to participate in all scheduled visits, treatment plan, or other trial procedures according to the protocol (except for the optional genetic component)

The above is a clinical trial inclusion criterion. Annotated with entity spans:
[Observation: Unable to participate] in all [Visit: scheduled visits], [Mood: treatment plan], or other [Procedure: trial procedures] according to the protocol ([Negation: except for] the optional [Observation: genetic component])